Clinical trial exclusion criterion:
Immunocompromised conditions;

Annotated entities:
- Condition: "Immunocompromised conditions"